What is the approximate size of gas vesicles?

The diameter of gas vesicles is approximately 100nm.